Contraindication to anticoagulation (heparin or warfarin)

The above is a clinical trial exclusion criterion. Annotated with entity spans:
[Condition: Contraindication] to [Drug: anticoagulation] ([Drug: heparin] or [Drug: warfarin])